Clinical trial exclusion criterion:
17. Pregnancy or breast-feeding

Entity relations:
- OR("Pregnancy", "breast-feeding")